Active myocarditis; malfunctioning artificial heart valve.

The above is a clinical trial exclusion criterion. Annotated with entity spans:
[Condition: Active myocarditis]; [Qualifier: malfunctioning] [Device: artificial heart valve].